Which disorder is rated by Palmini classification?

Palmini classification system is used for classification of focal cortical dysplasia.